一位 17 歲男性，為高三的學生。由父母陪同，主訴失眠、心悸、頭暈和注意力無法集中有 2 個月之久。病史記載病人最近作息不正常，常要求母親用各種理由向學校老師請假，漸漸對於上課內容無法跟上進度，考試成績大幅滑落。求診希望醫師能夠開一些保護腦神經的藥物，並幫助腦力與學習效率。理學檢查與血液檢驗並無異常。下列病人產生焦慮症狀的機制，何者較正確？
A. 純粹來自考試的壓力
B. 父母和老師不夠關心
C. 缺乏運動而體力差
D. 調適不良所引起

正確答案：D. 調適不良所引起